醫療品質評估方法中最常被採用的Donabedian之品質評估模式，下列何者不是其評估的主要構面？
A. 過程（Process）
B. 結構（Structure）
C. 結果（Outcome）
D. 表現（Performance）

正確答案：D. 表現（Performance）